眼科張醫師看針眼病人時，常遇到病人很怕痛，但不治療針眼又會持續的擴大，所以他必須用比較間接的方法；趁著做眼睛檢查時，在病人比較不注意的時候，進行麥粒腫切除術。這也是為了病人好才進行這樣的一個動作，不能怪他沒有跟病人講清楚，這樣的想法對不對？
A. 不對，任何醫療行為都要事先取得病人同意
B. 還好，簡單醫療行為不用事先取得病人同意
C. 還好，簡單醫療行為可以事後再取得病人同意
D. 還好，簡單醫療行為只要事後取得病人口頭同意即可

正確答案：A. 不對，任何醫療行為都要事先取得病人同意